Previous allergy reactions to progesterone products

The above is a clinical trial exclusion criterion. Annotated with entity spans:
Previous [Condition: allergy] reactions to [Drug: progesterone products]